history of asthma, acute rhinitis, nasal polyps, angioedema, urticaria or allergic reactions to aspirin or other non-steroidal anti-inflammatory drugs(including COX-2 inhibitors).

The above is a clinical trial exclusion criterion. Annotated with entity spans:
history of [Condition: asthma], [Condition: acute rhinitis], [Condition: nasal polyps], [Condition: angioedema], [Condition: urticaria] or [Condition: allergic reactions] to [Drug: aspirin] or [Qualifier: other] [Drug: non-steroidal anti-inflammatory drugs](including [Drug: COX-2 inhibitors]).